有關生物戰中肉毒桿菌毒素中毒（botulism）之表徵，下列敘述何者正確？
A. 瞳孔之光反射正常（normal light reflex）
B. 遠端肢體無力（distal limb weakness）
C. 下降型肢體癱瘓（descending paralysis）
D. 中樞性顏面神經麻痺（central facial palsy）

正確答案：C. 下降型肢體癱瘓（descending paralysis）